有關嬰兒肥厚性幽門狹窄（infantile hypertrophic pyloric stenosis）之敘述，下列何者正確？
A. 生化檢驗呈現高氯性代謝鹼中毒（hyperchloremic metabolic alkalosis）
B. 腹部 X-ray 呈現 double bubble sign
C. 手術方式：gastrojejunostomy
D. 身體診查時，上腹部可摸到橄欖狀腫塊（olive mass）

正確答案：D. 身體診查時，上腹部可摸到橄欖狀腫塊（olive mass）